皮脂腺（sebaceous gland）分泌，是何種分泌方式？
A. 部分分泌（merocrine）
B. 頂漿分泌（apocrine）
C. 全漿分泌（holocrine）
D. 擴散方式（diffusion）

正確答案：C. 全漿分泌（holocrine）